一位52歲男性突然發生右手的辨距不良（dysmetria），經頭部電腦斷層檢查發現是中腦左側紅核（red nucleus）附近的小出血。幾個月後，此患者出現喉部不自主的動作，檢查發現軟腭出現很有節奏性的2～ 5Hz向上收縮的動作。頭部核磁共振造影檢查最可能的發現是：
A. 左側齒狀核（dentate nucleus）肥大
B. 右側齒狀核（dentate nucleus）肥大
C. 左側下橄欖核（inferior olivary nucleus）肥大
D. 右側下橄欖核（inferior olivary nucleus）肥大

正確答案：C. 左側下橄欖核（inferior olivary nucleus）肥大